Clinical trial exclusion criterion:
Past or concurrent history of neoplasm other than stomach cancer, except for curatively treated non-melanoma skin cancer or in situ carcinoma of the cervix uteri

Entity relations:
- AND("history of", "neoplasm")
- Has_qualifier("treated", "curatively")
- AND("treated", "non-melanoma skin cancer")
- Has_negation("stomach cancer", "other than")
- AND("neoplasm", "stomach cancer")
- AND("neoplasm", "treated")
- Has_negation("treated", "except for")
- OR("non-melanoma skin cancer", "in situ carcinoma of the cervix uteri")